Clinical trial exclusion criterion:
Severe previous reaction or reaction considered immunological, such as anaphylaxis, facial swelling, severe rash, muscle ache with rise in serum creatine kinase, inflammatory myopathy, rhabdomyolysis or liver function abnormalities (aspartate transaminase (AST) or alanine transaminase (ALT) greater than 3 times upper limit or normal).

Entity relations:
- AND("muscle ache", "serum creatine kinase")
- Has_value("serum creatine kinase", "rise")
- Subsumes("aspartate transaminase", "AST")
- Subsumes("alanine transaminase", "ALT")
- Has_value("aspartate transaminase", "greater than 3 times upper limit or normal")
- Subsumes("liver function abnormalities", "aspartate transaminase")
- OR("aspartate transaminase", "alanine transaminase")
- OR("anaphylaxis", "rhabdomyolysis", "inflammatory myopathy", "muscle ache", "severe rash", "facial swelling,", "liver function abnormalities")